Clinical trial exclusion criterion:
Acetaminophen allergy or already receiving acetaminophen within 24 h of surgery

Entity relations:
- AND("allergy", "Acetaminophen")
- Has_temporal("acetaminophen", "within 24 h of surgery")
- OR("allergy", "acetaminophen")